Hampton’s hump is characteristic to which disease?

Hampton’s hump is characteristic to pulmonary embolism.